Clinical trial exclusion criterion:
Albumin < 3g/dL.

Annotated entities:
- Measurement: "Albumin"
- Value: "< 3g/dL"